Treatment with MMF at >1.5 g/D for over 4 weeks within the past 3 months.

The above is a clinical trial exclusion criterion. Annotated with entity spans:
Treatment with [Drug: MMF] at [Multiplier: >1.5 g/D for over 4 weeks] within the [Temporal: past 3 months].